Ulcers whose major axis measured with the electronic caliper is ≥ 2 mm

The above is a clinical trial inclusion criterion. Annotated with entity spans:
[Condition: Ulcers] whose [Measurement: major axis] [Qualifier: measured with the electronic caliper] is [Value: ≥ 2 mm]